Clinical trial exclusion criterion:
1. Patients with lumbar common diseases(e.g., Lumbar disc, Lumbar spinal stenosis, Lumbar slippage, etc)

Annotated entities:
- Condition: "lumbar diseases"
- Condition: "Lumbar disc"
- Condition: "Lumbar spinal stenosis"
- Condition: "Lumbar slippage"